C型肝炎的病人有高達30%會伴隨有腎臟病變，其中以下列何種變化最為少見？
A. 冷凝球蛋白腎小球腎炎（cryoglobulinemic glomerulonephritis）
B. 膜性腎病變（membranous glomerulonephritis）
C. 急性腎間質腎炎（acute interstitial nephritis）
D. 第一型膜增生性腎小球腎炎（type 1 membranoproliferative glomerulonephritis）

正確答案：C. 急性腎間質腎炎（acute interstitial nephritis）